Clinical trial exclusion criterion:
Any history of anorexia or bulimia within 2 years before Screening, Attention Deficit Hyperactivity Disorder, any Diagnostic and Statistical Manual of Mental Disorders, 5th Edition depressive disorder, bipolar disorder, or schizophrenia

Annotated entities:
- Temporal: "history"
- Condition: "anorexia"
- Condition: "bulimia"
- Temporal: "within 2 years before Screening"
- Reference_point: "Screening"
- Condition: "Attention Deficit Hyperactivity Disorder"
- Qualifier: "Diagnostic and Statistical Manual of Mental Disorders, 5th Edition"
- Condition: "depressive disorder"
- Condition: "bipolar disorder"
- Condition: "schizophrenia"